AST to platelet ratio index (APRI) =2.0 and Fibrosis-4 (FIB-4) =3.25

The above is a clinical trial exclusion criterion. Annotated with entity spans:
[Measurement: AST to platelet ratio index (APRI)] [Value: =2.0] and [Measurement: Fibrosis-4 (FIB-4)] [Value: =3.25]